Age 18-65 years

The above is a clinical trial inclusion criterion. Annotated with entity spans:
[Person: Age] [Value: 18-65 years]